Clinical trial exclusion criterion:
3. Pregnancy or expectation of pregnancy during the study.

Entity relations:
- Has_mood("pregnancy", "expectation")
- Has_temporal("Pregnancy", "during the study")
- OR("Pregnancy", "pregnancy")